two or more licensed NRTIs

The above is a clinical trial inclusion criterion. Annotated with entity spans:
[Multiplier: two or more] [Qualifier: licensed] [Drug: NRTI]s